Clinical trial exclusion criteria:
Known fetal anomaly
Other indication for intrapartum antibiotics (endocarditis prophylaxis, other known maternal infection)

Annotated entities:
- Condition: "fetal anomaly"
- Condition: "indication"
- Drug: "intrapartum antibiotics"
- Condition: "endocarditis prophylaxis"
- Condition: "maternal infection"